下列那一種原蟲因具有變異性表面醣蛋白（variant surface glycoproteins, VSG）持續改變的機轉，得以逃避宿主免疫系統之攻擊作用？
A. 岡比亞錐蟲（Trypanosoma gambiense）
B. 枯西氏錐蟲（Trypanosoma cruzi）
C. 弓蟲（Toxoplasma gondii）
D. 杜氏利什曼原蟲（Leishmania donovani）

正確答案：A. 岡比亞錐蟲（Trypanosoma gambiense）